Having been diagnosed as HCC within the past 5 years

The above is a clinical trial exclusion criterion. Annotated with entity spans:
Having been diagnosed as [Condition: HCC] within the [Temporal: past 5 years]